History of knee surgery in the target knee;

The above is a clinical trial exclusion criterion. Annotated with entity spans:
[Temporal: History] of [Procedure: knee surgery] in the [Reference_point: target knee];